Platelets >150,000

The above is a clinical trial inclusion criterion. Annotated with entity spans:
[Measurement: Platelets] [Value: >150,000]